What is caused by the ectopic expression of CTCF?

ectopic expression of CTCF in K562 cells led to growth retardation and promotion of differentiation into the erythroid lineage;.